Clinical trial exclusion criterion:
Loss of function is expected to be improved by reliable tendon transfer, tenodesis or arthrodesis that is available

Entity relations:
- Has_mood("tendon transfer", "improved by")
- AND("Loss of function", "tendon transfer")
- OR("tendon transfer", "tenodesis", "arthrodesis")